La forma B del ADN:
1. Está formada por una doble hélice levógira con dos cadenas de nucleótidos antiparalelas.
2. Es más ancha y más larga que la forma A.
3. Tiene pares de bases nitrogenadas perpendiculares al eje de la hélice.
4. Corresponde al ADN deshidratado.
5. Es la forma minoritaria que presenta el ADN en condiciones fisiológicas.

Respuesta correcta: 3. Tiene pares de bases nitrogenadas perpendiculares al eje de la hélice.